8-22 weeks gestation

The above is a clinical trial inclusion criterion. Annotated with entity spans:
[Multiplier: 8-22 weeks] [Condition: gestation]